上段食道癌多為？
A. 狀細胞癌（squamous cell carcinoma）
B. 腺癌（adenocarcinoma）
C. sarcoma
D. adenosquamous cell carcinoma

正確答案：A. 狀細胞癌（squamous cell carcinoma）